HCV disease staging within 12 months prior to enrollment by liver biopsy, transient elastography, or biochemical testing

The above is a clinical trial inclusion criterion. Annotated with entity spans:
[Qualifier: HCV] [Procedure: disease staging] [Temporal: within 12 months prior to enrollment] by [Procedure: liver biopsy], [Procedure: transient elastography], or [Procedure: biochemical testing]